下列何者不是自律神經反射失調（autonomic dysreflexia）之臨床症狀？
A. 血壓上升
B. 心跳加速
C. 臉部潮紅
D. 盜汗

正確答案：B. 心跳加速